Clinical trial exclusion criterion:
Under the age of 15

Entity relations:
- Has_value("age", "Under 15")